下列關於潰瘍性大腸炎（ulcerative colitis）之敘述，何者錯誤？
A. 患者常解血便
B. 常侵犯直腸
C. 主要病灶在腸之黏膜層（mucosa）
D. 好發生在國人

正確答案：D. 好發生在國人